Clinical trial exclusion criterion:
Any new or definitely enlarging T2/FLAIR lesion or new gadolinium-enhancing lesion within the past three years (at least two scans separated by at least three years must be reviewed) on brain or spine MRI scan. Lesions must be 3mm or larger to be exclusionary.

Entity relations:
- Has_qualifier("lesion", "gadolinium-enhancing")
- Has_multiplier("scans", "at least two")
- Has_temporal("scans", "separated by at least three years")
- Has_qualifier("Lesions", "3mm or larger")
- Has_temporal("T2/FLAIR lesion", "within the past three years")
- AND("T2/FLAIR lesion", "scans")
- Subsumes("T2/FLAIR lesion", "Lesions")
- Has_qualifier("T2/FLAIR lesion", "3mm or larger")
- Has_temporal("gadolinium", "within the past three years")
- AND("gadolinium", "scans")
- Subsumes("gadolinium", "Lesions")
- Has_qualifier("gadolinium", "3mm or larger")
- OR("brain MRI scan", "spine MRI scan")
- OR("T2/FLAIR lesion", "lesion")